Allergy to methadone, hydromorphone, or ketamine

The above is a clinical trial exclusion criterion. Annotated with entity spans:
Allergy to [Drug: methadone], [Drug: hydromorphone], or [Drug: ketamine]